Acute coronary syndrome

The above is a clinical trial exclusion criterion. Annotated with entity spans:
[Condition: Acute coronary syndrome]